Clinical trial exclusion criterion:
HIV positive or active HBV infection or other uncontrolled systematic infection

Annotated entities:
- Condition: "HIV positive"
- Condition: "active HBV infection"
- Condition: "systematic infection"
- Qualifier: "uncontrolled"